一位 52 歲女性病人，有前頸部腫瘤，無心悸等症狀，身體診查發現 5 公分結節，在左葉甲狀腺位置硬而不易移動，甲狀腺功能正常，超音波掃描顯示低回音及邊緣不規則，且有周圍肌肉及氣管界線不清之現象，細胞穿刺檢查為疑似甲狀腺乳突癌（papillary carcinoma），無淋巴腺腫大，胸部放射線影像及骨頭掃描正常，下列何者是最好的治療？
A. 先行碘 131 治療
B. 繼續追蹤觀察
C. 先行甲狀腺全切除術
D. 先行體外放射線照射治療

正確答案：C. 先行甲狀腺全切除術